Clinical trial exclusion criteria:
Breast Carcinoma

Annotated entities:
- Condition: "Breast Carcinoma"